Clinical trial exclusion criterion:
Subjects with poor-controlled arterial hypertension (systolic blood pressure> 140 mmHg and diastolic blood pressure > 90 mm Hg) despite standard medical management; Coronary heart disease greater than ClassII; II-level arrhythmia (including QT interval prolongation, for man = 450 ms, for woman = 470 ms) together with Class II cardiac dysfunction;

Annotated entities:
- Condition: "arterial hypertension"
- Qualifier: "poor-controlled"
- Measurement: "systolic blood pressure"
- Value: "> 140 mmHg"
- Measurement: "diastolic blood pressure"
- Value: "> 90 mm Hg"
- Condition: "Coronary heart disease"
- Qualifier: "greater than ClassII"
- Condition: "arrhythmia"
- Qualifier: "II-level"
- Qualifier: "Subjects"
- Condition: "QT interval prolongation"
- Condition: "cardiac dysfunction"
- Qualifier: "Class II"